Clinical trial inclusion criteria:
Adults patients aged 18 to 85 years
Diagnosed with Major Depressive Disorder, unipolar or bipolar depression
Undergoing ECT for treatment of their symptoms
Currently residing in Manitoba

Annotated entities:
- Person: "Adults"
- Person: "aged"
- Value: "18 to 85 years"
- Condition: "Major Depressive Disorder"
- Condition: "unipolar depression"
- Condition: "bipolar depression"
- Procedure: "ECT"
- Temporal: "Undergoing"
- Visit: "Manitoba"
- Observation: "Currently residing"